Patients aged at least 18 years

The above is a clinical trial inclusion criterion. Annotated with entity spans:
Patients [Person: aged] [Value: at least 18 years]